Clinical trial inclusion criterion:
provision of informed consent

Annotated entities:
- Informed_consent: "provision of informed consent"